List diseases that are caused by the Meningococcus B?

the prevention of paediatric bacterial meningitis and septicaemia has entered a new era with the availability of two vaccines against capsular group b meningoco